What is Targeted Chromatin Capture (T2C)?

Targeted Chromatin Capture (T2C) is an efficient, easy, and affordable with high (restriction fragment) resolution tool to address both genome compartmentalization and chromatin-interaction networks for specific genomic regions at high resolution for both clinical and non-clinical research.